The patient was receiving anti-vitamin K (AVK) treatment before percutaneous implantation of the aortic valve

The above is a clinical trial inclusion criterion. Annotated with entity spans:
The patient was receiving [Drug: anti-vitamin K] ([Drug: AVK]) treatment [Temporal: before percutaneous implantation of the aortic valve]